Patient is willing to be randomized and participate.

The above is a clinical trial inclusion criterion. Annotated with entity spans:
[Post-eligibility: Patient is willing to be randomized and participate].